En análisis gavimétrico el fenómeno de oclusión hace referencia a:
1. La precipitación no cuantitativa del catión o del anión.
2. La precipitación del ión a una temperatura inadecuada.
3. El atrapamiento de impurezas dentro del precipitado.
4. La sustitución de un ión por otro en la estructura cristalina.

Respuesta correcta: 3. El atrapamiento de impurezas dentro del precipitado.